Clinical trial exclusion criterion:
Known severe renal insufficiency

Entity relations:
- Has_qualifier("renal insufficiency", "severe")